¿Cómo es posible que durante la replicación del DNA bacteriano las hebras guía (o adelantada) y retardada se sinteticen de forma coordinada?
1. La hebra guía se sintetiza en dirección 5´-3´ y la retardada en dirección 3´-5´.
2. La holoenzima DNA Polimerasa III contienen dos copias del núcleo catalítico de la enzima.
3. Proteínas unidas a la hebra retardada controlan la velocidad de síntesis de la hebra guía.
4. Enzimas específicas controlan la apertura de la horquilla de replicación.
5. La helicasa controla la velocidad de síntesis en ambas hebras.

Respuesta correcta: 2. La holoenzima DNA Polimerasa III contienen dos copias del núcleo catalítico de la enzima.